Clinical trial inclusion criterion:
Supervision available for study medication

Annotated entities:
- Non-query-able: "Supervision available for study medication"